Clinical trial exclusion criterion:
Known history of significant inflammatory disease, other than COPD (e.g. rheumatoid arthritis and systemic lupus erythematosus).

Annotated entities:
- Condition: "inflammatory disease"
- Condition: "COPD"
- Condition: "rheumatoid arthritis"
- Condition: "systemic lupus erythematosus"
- Negation: "other than"
- Qualifier: "significant"